Clinical trial inclusion criterion:
Viremia >= 3 log UI/ml

Annotated entities:
- Measurement: "Viremia"
- Value: ">= 3 log UI/ml"